一位56歲男性病人因胸悶住院。他有糖尿病、高血壓、與抽菸史。冠狀動脈血管攝影檢查顯示左冠狀動脈主幹 85% 狹窄、左前降支 80%狹窄、左回旋支 77%狹窄、右冠狀動脈 90%狹窄。下列敘述何者正確？①依冠狀動脈血管攝影檢查前家屬之決定，立即裝置 藥支架（drug-eluting stent） ②冠狀動脈血管攝影檢查時，經與家屬商量後，立即裝置裸金支架（bared-metal stent） ③裝置支架前，不須請心臟外科醫師向病人及其家屬解釋冠狀動脈繞道手術之優缺點 ④裝置支架時，手術室須準備好，以便可立即進行緊急手術
A. ①②③
B. 僅①③
C. ②④
D. 僅④

正確答案：D. 僅④